Describe clinical presentation of Escobar syndrome.

The Escobar variant of multiple pterygium syndrome (MPS) is a rare, autosomal recessive disorder which is characterized by pterygia, arthrogryposis (joint contractures), facial dysmorphism along with other anomalies.